Clinical trial exclusion criterion:
Subject exclusion period in another study without direct individual benefit

Annotated entities:
- Post-eligibility: "Subject exclusion period in another study without direct individual benefit"
- Context_Error: "Subject exclusion period in another study without direct individual benefit"
- Non-query-able: "Subject exclusion period in another study without direct individual benefit"